La acción microbiocida del yodo y cloro y muchos de sus derivados se debe a que:
1. Son agentes oxidantes.
2. Se unen específicamente a los centros activos de los enzimas.
3. Se unen específicamente a proteínas ribosómicas.
4. Inducen poros en las membranas.
5. Provocan la disolución de los fosfolípidos de membrana.

Respuesta correcta: 1. Son agentes oxidantes.